Clinical trial inclusion criterion:
RTV to COBI/COBI-containing fixed-dose combination regimens

Annotated entities:
- Drug: "RTV"
- Drug: "COBI"
- Procedure: "COBI-containing fixed-dose combination regimens"